Clinical trial exclusion criterion:
hypersensitivity to selective 5-HT receptor antagonists

Annotated entities:
- Condition: "hypersensitivity"
- Drug: "selective 5-HT receptor antagonists"